神經細胞被稱為紅色神經原（red neurons）的原因是因為：
A. 含血鐵素
B. 含消耗色素
C. 在缺血缺氧造成急性損傷
D. 壞死後鈣鹽沈積

正確答案：C. 在缺血缺氧造成急性損傷